Which TREX mRNA export complex subunits have been implicated in neurodevelopmental disorders?

THOC1, THOC2 and THOC5 have been implicated in neurodegeneration and cancer. THOC6, THO7 and THO8 have been shown to be implicated in NDDs.